Concurrent participation in another clinical trial of an investigational medicinal product.

The above is a clinical trial exclusion criterion. Annotated with entity spans:
[Competing_trial: Concurrent participation in another clinical trial of an investigational medicinal product].